Clinical trial exclusion criterion:
known or suspected hypersensitivity to empagliflozin, glimepiride, or any excipients; and / or known or suspected hypersensitivity to sulfonylureas, sulfonamides or SGLT2 inhibitors in general

Annotated entities:
- Condition: "hypersensitivity"
- Drug: "empagliflozin"
- Drug: "glimepiride"
- Condition: "hypersensitivity"
- Drug: "sulfonylureas"
- Drug: "sulfonamides"
- Drug: "SGLT2 inhibitors"